Clinical trial exclusion criterion:
Plan for diagnostic-only coronary angiography

Entity relations:
- Has_qualifier("coronary angiography", "diagnostic-only")